Clinical trial exclusion criterion:
Life expectancy < 6 months.

Annotated entities:
- Observation: "Life expectancy"
- Value: "< 6 months"